Scheduled 1 or 2-level ACDF spine surgery

The above is a clinical trial inclusion criterion. Annotated with entity spans:
Scheduled [Qualifier: 1] or [Qualifier: 2-level] [Procedure: ACDF spine surgery]